Clinical trial exclusion criterion:
Active consumption of alcohol and/or drugs

Entity relations:
- Has_qualifier("consumption of alcohol", "Active")
- OR("consumption of alcohol", "drugs consumption of")